¿Cuál de los siguientes síntomas es característico de desatención en el Trastorno por Déficit de Atención con Hiperactividad (TDAH)? :
1. Habitualmente les cuesta organizar tareas y actividades.
2. Habitualmente contestan antes de finalizar la pregunta.
3. Habitualmente tienen dificultad para jugar tranquilamente.
4. Habitualmente se remueven en su asiento.
5. Habitualmente interfieren en las actividades de otros.

Respuesta correcta: 1. Habitualmente les cuesta organizar tareas y actividades.